¿Qué inmunoglobulina sérica sintetizará un linfocito B activado que no ha sido estimulado a través de CD40?:
1. Ninguna.
2. IgE.
3. IgM.
4. IgA.
5. IgG.

Respuesta correcta: 3. IgM.